Diferentes citoquinas inducen el cambio de isotipo de las diferentes clases de anticuerpos. De las siguientes parejas de citoquina/isotipo, escoja la correcta:
1. IL-4/IgE.
2. IL-4/IgM.
3. IL-5/IgG.
4. IFN-/IgM.
5. TGF-/IgA.

Respuesta correcta: 1. IL-4/IgE.